下列有關急性散發性腦脊髓炎（acute disseminated encephalomyelitis, ADEM）的敘述，何者錯誤？
A. 肇因於病毒感染後或疫苗接種後誘發的自體免疫疾病
B. 很容易復發
C. 若有嚴重大腦傷害，死亡率高
D. 病理變化以髓鞘（myelin）的破壞為主

正確答案：B. 很容易復發